Physically healthy adults age 18-55 who meet DSM-5 criteria for insomnia and Criterion A (exposure to a traumatic event) for PTSD. The index trauma must have occurred within the past 5 years and at least 3 months before enrolling, and insomnia symptoms must have started or worsened after the exposure to the index trauma

The above is a clinical trial inclusion criterion. Annotated with entity spans:
Physically [Qualifier: healthy] [Person: adults] [Person: age] [Value: 18-55] who meet [Qualifier: DSM-5] criteria for [Condition: insomnia] and [Qualifier: Criterion A] (exposure to a traumatic event) for [Condition: PTSD]. The [Qualifier: index] [Condition: trauma] must have occurred within [Temporal: the past 5 years and at least 3 months] before enrolling, [Non-query-able: and insomnia symptoms must have started or worsened after the exposure to the index trauma]